Clinical trial exclusion criterion:
5. New York Heart Association (NYHA) Class II or higher congestive heart failure.

Entity relations:
- Has_value("New York Heart Association (NYHA)", "Class II or higher")
- AND("congestive heart failure", "New York Heart Association (NYHA)")